一位35 歲女性因神智不清送至急診處。抽血檢查發現total bilirubin 3.5 mg/dL，serum creatinine 2.4 mg/dL， 5 g/dL，platelet 44,000/mm3。下列何者是最不可能的診斷？
A. Favism
B. Thrombotic thrombocytopenic purpura
C. Systemic lupus erythematosus
D. Eclampsia

正確答案：A. Favism